氯乙烯單體會造成下列那一項職業性癌症？
A. 白血病
B. 肺癌
C. 肝血管肉瘤
D. 腦瘤

正確答案：C. 肝血管肉瘤